下列疾病何者不是造成骨質疏鬆症的次發性病因？
A. 甲狀腺功能亢進
B. 第 1 型糖尿病
C. 副甲狀腺功能不足
D. 早發性更年期

正確答案：C. 副甲狀腺功能不足